Concomitant medications that fall into the categories below could potentially lead to adverse reactions and should be considered cautionary.

The above is a clinical trial exclusion criterion. Annotated with entity spans:
[Undefined_semantics: Concomitant medications that fall into the categories below could potentially lead to adverse reactions and should be considered cautionary.]